Un varón de 40 años acude al servicio de urgencias por inflamación de la rodilla derecha de unas 24 horas de evolución. El paciente no refiere traumatismo previo y es el primer episodio de artritis que presenta. A la anamnesis dirigida refiere que hace 4 semanas ha regresado de un viaje por Marruecos y que estando allí presentó escalofríos y diarreas que remitieron tras una semana. A la exploración se evidencia además inflamación del tendón de Aquiles derecho. ¿Cuál es la actitud a seguir?
1. Se trata de una espondiloartropatía, iniciaría tratamiento con metotrexato.
2. Inmovilizar la rodilla con un vendaje durante 15 días y dar antiinflamatorios no esteroideos.
3. Practicar una artrocentesis para realizar cultivo, análisis de microcristales y recuento celular del líquido sinovial.
4. Realizar una artroscopia.
5. Se trata de una artritis gotosa, iniciaría tratamiento con alopurinol.

Respuesta correcta: 3. Practicar una artrocentesis para realizar cultivo, análisis de microcristales y recuento celular del líquido sinovial.